Clinical trial exclusion criterion:
Chronic preoperative opioid consumption.

Entity relations:
- Has_temporal("opioid", "preoperative")
- Has_qualifier("opioid", "Chronic")